Patients with documented allergies to propofol, dexmedetomidine, fentanyl, eggs or egg products, or soy or soy products.

The above is a clinical trial exclusion criterion. Annotated with entity spans:
Patients with documented [Condition: allergies] to [Drug: propofol], [Drug: dexmedetomidine], [Drug: fentanyl], [Observation: eggs] or [Observation: egg products], or [Observation: soy] or [Observation: soy products].